Patients who are unable or unwilling to give informed consent

The above is a clinical trial exclusion criterion. Annotated with entity spans:
[Non-query-able: Patients who are unable or unwilling to give informed consent]